Paciente de 57 años, diagnosticado de adenocarcinoma de colon estadio T3N1M0. Fue tratado con resección seguida de quimioterapia postoperatoria FOLFOX (fluorouracilo, leucovorín y oxaliplatino) durante seis meses. En un control rutinario, dos años después, se detecta elevación de antígeno carcinoembrionario (CEA) a 30 ng/mL (previo menor de 2 ng/mL). No tiene síntomas, el examen físico es anodino, la radiografía de tórax es normal. En la TC se aprecia una masa de 3 cm en el lóbulo hepático derecho, que capta en PET. No se observan otras alteraciones en TC ni en PET. ¿Qué actitud le parece más correcta?
1. Quimioterapia con FOLFIRI (fluorouracilo, leucovorin e irinotecán) más bevacizumab.
2. Monoquimioterapia con capecitabina.
3. Valoración por cirugía de resección de la lesión hepática.
4. Radioterapia hepática.

Respuesta correcta: 3. Valoración por cirugía de resección de la lesión hepática.